refuse to enrollment

The above is a clinical trial exclusion criterion. Annotated with entity spans:
[Informed_consent: refuse to enrollment]